En el catabolismo hepático de la glucosa a través de la glucolisis:
1. La glucoquinasa se inhibe alostéricamente con altas concentraciones de glucosa.
2. Se consumen 2 moléculas de NADH+H+ y 4 moléculas de ATP por cada glucosa que se oxida hasta piruvato.
3. Todas las reacciones son reversibles excepto las catalizadas por la glucoquinasa, fosfofrutoquinasa y la piruvato quinasa.
4. Una alta relación ATP/AMP activa la formación de piruvato.

Respuesta correcta: 3. Todas las reacciones son reversibles excepto las catalizadas por la glucoquinasa, fosfofrutoquinasa y la piruvato quinasa.